一位 58 歲男性，無潛在性疾病，過去身體狀況尚稱良好，最近一星期出現上腹脹、黃疸、茶色尿至醫院求治，腹部超音波、內視鏡逆行性膽道胰管攝影（ERCP）顯示有一 Periampullary tumor，若須以手術處理，試問術前評估，那一項非絕對必要之檢查？
A. 腹部電腦斷層（Abdominal CT scan）
B. 胸部 X 光（Chest X-ray）
C. 腹部核磁共振（MRI）
D. 小腸攝影（Small bowel series）

正確答案：D. 小腸攝影（Small bowel series）